Significant motor complication affecting daily activities

The above is a clinical trial exclusion criterion. Annotated with entity spans:
[Qualifier: Significant] [Condition: motor complication] affecting daily activities